下列那一種抗生素較不適合用來治療綠膿桿菌（Pseudomonas aeruginosa）的感染？
A. ceftazidime
B. aztreonam
C. ertapenem
D. ciprofloxacin

正確答案：C. ertapenem